副交感神經興奮時，最可能造成下列何者收縮？
A. 前列腺（prostate）
B. 迫尿肌（detrusor muscle）
C. 輸精管（vas deferens）
D. 儲精囊（seminal vesicle）

正確答案：B. 迫尿肌（detrusor muscle）